Currently responding to medication treatment, without clinical reasons to change.

The above is a clinical trial exclusion criterion. Annotated with entity spans:
[Non-query-able: Currently responding to medication treatment, without clinical reasons to change].